¿Qué valores obtenidos en una gasometría arterial se consideran dentro de los parámetros normales en una persona adulta?:
1. PaCO2 65mmHg, PaO2 80mmHg, pH 7,55.
2. PaCO2 35mmHg, PaO2 110mmHg, pH 7,55.
3. PaCO2 35mmHg, PaO2 90mmHg, pH 7,35.
4. PaCO2 80mmHg, PaO2 35mmHg, pH 7,35.
5. PaCO2 20mmHg, PaO2 90mmHg, pH 7,45.

Respuesta correcta: 3. PaCO2 35mmHg, PaO2 90mmHg, pH 7,35.